Patients with trauma within 6 months pre-operative.

The above is a clinical trial exclusion criterion. Annotated with entity spans:
Patients with [Procedure: trauma] [Temporal: within 6 months pre-operative].